Clinical diagnosis of allergic rhinitis based on sneeze attacks, runny/blocked/itchy nose in the absence of a common cold during the previous 12 months.

The above is a clinical trial inclusion criterion. Annotated with entity spans:
Clinical diagnosis of [Condition: allergic rhinitis] based on [Condition: sneeze attacks], [Condition: runny]/[Condition: blocked]/[Condition: itchy nose] in the [Negation: absence] of a [Condition: common cold] [Temporal: during the previous 12 months].